下列有關眼球運動的敘述，何者錯誤？
A. Duction 是指單眼的運動，包括眼球的內旋（intorsion）和外旋（extorsion）等
B. Version 是指雙眼的同向運動，包括看右上（dextro-elevation）或左下（levo-depression）等
C. Vergence 是指雙眼的異向運動，包括輻輳會聚（convergence）或發散（divergence）等
D. 調適性輻輳會聚（accommodative convergence）屬於一種張力性輻輳會聚（tonic convergence）

正確答案：D. 調適性輻輳會聚（accommodative convergence）屬於一種張力性輻輳會聚（tonic convergence）